Clinical trial inclusion criterion:
If female, may participate if she is not pregnant, not breastfeeding, and at least one of the following: 1) Not a woman of childbearing potential (WOCBP); or 2) A WOCBP who agrees to follow the study contraceptive guidance during the treatment period and for at least 7 days after the last dose of study treatment.

Entity relations:
- Has_negation("pregnant", "not")
- Has_negation("breastfeeding", "not")
- Has_index("during the treatment period", "the treatment period")
- Has_index("for at least 7 days after the last dose of study treatment", "the last dose of study treatment")
- Has_temporal("contraceptive guidance", "during the treatment period")
- Has_negation("woman of childbearing potential (WOCBP)", "Not")
- Has_multiplier("woman of childbearing potential (WOCBP)", "at least one")
- AND("female", "pregnant")
- Has_context("female", "breastfeeding")
- OR("during the treatment period", "for at least 7 days after the last dose of study treatment")
- OR("woman of childbearing potential (WOCBP)", "WOCBP")